Clinical trial inclusion criterion:
Liver function within normal range for age

Annotated entities:
- Measurement: "Liver function"
- Value: "within normal range for age"